Clinical trial exclusion criterion:
alpha 1-antitrypsin deficiency: Subjects with known alpha-1 antitrypsin deficiency as the underlying cause of COPD.

Entity relations:
- AND("COPD", "alpha-1 antitrypsin deficiency")
- Subsumes("alpha 1-antitrypsin deficiency", "COPD")